What virus is the  Gardisil vaccine used for?

Gardisil is a 16-component vaccine against human papillomavirus (HPV), which has recently been licensed in Europe, Canada and Australia.